What is 23andMe?

We first take a look at how personal genomics services, exemplified by the company 23andMe,